Which TREX mRNA export complex subunits have been implicated in neurodevelopmental disorders?

THOC1, THOC2 and THOC5 have been implicated in neurodegeneration and cancer. THOC6, THO7 and THO8 have been shown to be implicated in NDDs and cancer, respectively.